Diabetes

The above is a clinical trial inclusion criterion. Annotated with entity spans:
[Condition: Diabetes]